Clinical trial exclusion criterion:
Has received depot antipsychotic medication within one cycle prior to screening.

Annotated entities:
- Drug: "depot antipsychotic medication"
- Temporal: "within one cycle prior to screening"
- Reference_point: "screening"